En la valoración de una base con ácido clorhídrico, se sabe que el punto de equivalencia aparece a pH 5.54. Si se utiliza como indicador el púrpura de bromocresol, cuyo intervalo de viraje es 5.2-6.8, el punto final se observa a pH:
1. 6.0, con un pequeño error por defecto.
2. 6.8, con un error por exceso.
3. 5.2, con un pequeño error por exceso.
4. 5.54. No hay error.
5. 6.0, con un error por exceso.

Respuesta correcta: 3. 5.2, con un pequeño error por exceso.